Clinical trial inclusion criterion:
Subjects aged 12-65.

Annotated entities:
- Person: "aged"
- Value: "12-65"